Clinical trial exclusion criterion:
Allergy to benzodiazepines

Entity relations:
- AND("Allergy", "benzodiazepines")